下列何種治療 congestive heart failure 的藥物，其作用機轉是經由增加 NO 而使血管舒張來達成的？
A. Dopamine
B. Nitroglycerin
C. Nesiritide
D. Milrinone

正確答案：B. Nitroglycerin